Men or women at least 19 years of age

The above is a clinical trial inclusion criterion. Annotated with entity spans:
[Person: Men] or [Person: women] [Value: at least 19 years] of [Person: age]